25-50 years of age

The above is a clinical trial inclusion criterion. Annotated with entity spans:
[Value: 25-50 years] of [Person: age]